Sensistivity/allergy against anesthetic agents

The above is a clinical trial exclusion criterion. Annotated with entity spans:
[Condition: Sensistivity]/[Condition: allergy] against [Drug: anesthetic agents]